Clinical trial inclusion criterion:
use of EEA stapler anastomosis

Annotated entities:
- Device: "EEA stapler anastomosis"